Clinical trial exclusion criterion:
Underlying illness

Annotated entities:
- Condition: "Underlying illness"
- Undefined_semantics: "Underlying illness"